Prisoners (as defined by Office of Human Research Protection) at the time of enrollment ARE NOT ELIGIBLE for study entry. However, subjects who become prisoners after being enrolled will be included and not be withdrawn from the study. Patients on parole or probation are eligible for enrollment.

The above is a clinical trial exclusion criterion. Annotated with entity spans:
[Person: Prisoners] (as defined by [Qualifier: Office of Human Research Protection]) [Temporal: at the time of enrollment] ARE NOT ELIGIBLE for study entry. [Non-representable: However, subjects who become prisoners after being enrolled will be included and not be withdrawn from the study. Patients on parole or probation are eligible for enrollment.]